Normal baseline cardiac function based upon pre-operative evaluation

The above is a clinical trial inclusion criterion. Annotated with entity spans:
[Value: Normal] [Measurement: baseline] [Measurement: cardiac function] based upon [Procedure: pre-operative evaluation]